Clinical trial exclusion criterion:
Any condition that prevents participation in the study, including pregnancy and other contraindications for Ventavis treatment (as listed in the current Ventavis Summary of Product Characteristics and patient package insert)

Annotated entities:
- Condition: "pregnancy"
- Condition: "contraindications"
- Procedure: "Ventavis treatment"
- Qualifier: "Ventavis Summary of Product Characteristics and patient package insert"